下列關於惡性間皮細胞癌（malignant mesothelioma）的敘述，何者錯誤？
A. 與石綿（asbestos）的暴露有明顯的因果關係
B. 抽菸不會增加罹患惡性間皮細胞癌的風險
C. 在組織免疫染色上，CEA與TTF-1染色常呈現陽性反應
D. 在臺灣，拆船業與水泥業工作者是屬於高風險群

正確答案：C. 在組織免疫染色上，CEA與TTF-1染色常呈現陽性反應